Clinical trial exclusion criterion:
• Live vaccinations (3 months off drug)

Entity relations:
- Has_temporal("Live vaccinations", "3 months off drug")